What are 3 symptoms of Waardenburg Syndrome?

Waardenburg syndrome (WS) is a rare autosomal dominant disorder characterized by dystopia canthorum, auditory, pigmentary abnormalities, and sensorineural deafness.